Clinical trial exclusion criterion:
Chronic administration (defined as more than 14 days) of immunosuppressants or other immune-modifying drugs within six months prior to the first administration of the study vaccine.

Entity relations:
- Subsumes("Chronic", "more than 14 days")
- Has_qualifier("immunosuppressants", "Chronic")
- Has_temporal("immunosuppressants", "within six months prior")
- Has_qualifier("other immune-modifying drugs", "Chronic")
- Has_temporal("other immune-modifying drugs", "within six months prior")